Pathologically altered blood pH, or oxygen saturation, or carbon dioxide unless corrected prior to the start of study treatment

The above is a clinical trial exclusion criterion. Annotated with entity spans:
[Value: Pathologically altered] [Measurement: blood pH], or [Measurement: oxygen saturation], or [Measurement: carbon dioxide] unless corrected prior to the start of study treatment